No gingivitis (Community Periodontal Index score = 0).

The above is a clinical trial inclusion criterion. Annotated with entity spans:
[Negation: No] [Condition: gingivitis] ([Measurement: Community Periodontal Index score] [Value: = 0]).